Clinical trial exclusion criterion:
subject unaffiliated insurance

Annotated entities:
- Non-query-able: "subject unaffiliated insurance"